clinical central nervous dysfunction

The above is a clinical trial exclusion criterion. Annotated with entity spans:
clinical [Condition: central nervous dysfunction]